急診室裡一名患有頑固癲癇症的 8 歲男童，因左手肘骨折變形，需麻醉予以復位。下列何種藥物選擇是首選？
A. ketamine＋midazolam
B. midazolam
C. fentany1＋midazolam
D. oxycodone

正確答案：C. fentany1＋midazolam